Clinical trial exclusion criterion:
Chronic obstructive pulmonary disease

Annotated entities:
- Condition: "obstructive pulmonary disease"
- Multiplier: "Chronic"